Participation in another clinical trial within the past 90 days.

The above is a clinical trial exclusion criterion. Annotated with entity spans:
[Non-query-able: Participation in another clinical trial within the past 90 days].